65歲男性看門診，主訴三天前大便有血絲，醫師做肛診檢查未發現有血跡，下列有關醫師的說法何 者最適當？
A. 下消化道出血比上消化道出血具有生命危險性
B. 年紀大不是上消化道出血的危險因子
C. 大多數急性消化道出血不會自動停止流血
D. 下消化道出血可能來自空腸（jejunum）

正確答案：D. 下消化道出血可能來自空腸（jejunum）